Clinical trial exclusion criterion:
History of clinically significant allergy or adverse event with protease inhibitors

Entity relations:
- AND("allergy", "protease inhibitors")
- OR("allergy", "adverse event")